cognitive impairment (Mini-Mental Status Examination score: illiterate 13 points; elementary and middle school 18 points; and high-school 26 points; or inability to respond to verbal command);

The above is a clinical trial exclusion criterion. Annotated with entity spans:
[Condition: cognitive impairment] ([Measurement: Mini-Mental Status Examination score]: [Observation: illiterate] [Value: 13 points]; [Observation: elementary] and [Observation: middle school] [Value: 18 points]; and [Observation: high-school] [Value: 26 points]; or [Condition: inability to respond to verbal command]);